Clinical trial inclusion criterion:
Normal acquired/inherited thrombophilia profile: LAC, ACA IgG/IgM, Prot S, Antithrombin III, beta-2 glycoprotein, Factors V, II, MTHFR.

Entity relations:
- Has_value("thrombophilia profile", "Normal")
- Subsumes("thrombophilia profile", "LAC")
- Subsumes("thrombophilia profile", "ACA IgG")
- Subsumes("thrombophilia profile", "Prot S")
- Subsumes("thrombophilia profile", "Antithrombin III")
- Subsumes("thrombophilia profile", "ACA IgM")
- Subsumes("thrombophilia profile", "beta-2 glycoprotein")
- Subsumes("thrombophilia profile", "Factors V")
- Subsumes("thrombophilia profile", "Factors II")
- Subsumes("thrombophilia profile", "MTHFR")